Are currently imprisoned or in psychiatric hospitalization

The above is a clinical trial exclusion criterion. Annotated with entity spans:
Are currently [Person: imprisoned] or in [Observation: psychiatric hospitalization]